Clinical trial exclusion criterion:
14. Concomitant administration of any prescription or over the counter medications known to alter P450 enzyme or P-gp activity

Annotated entities:
- Parsing_Error: "14."
- Drug: "medications known to alter P450 enzyme activity"
- Drug: "medications known to alter P-gp activity"
- Temporal: "Concomitant"